Clinical trial exclusion criterion:
Positive hepatitis C or hepatitis B surface antigen test and/or hepatits B core antibody test for immunoglobulin G (IgG) and/or immunoglobulin M (IgM).

Entity relations:
- Has_qualifier("hepatits B core antibody test", "immunoglobulin G (IgG)")
- Has_value("hepatitis C surface antigen test", "Positive")
- OR("immunoglobulin G (IgG)", "immunoglobulin M (IgM)")
- OR("hepatitis C surface antigen test", "hepatitis B surface antigen test", "hepatits B core antibody test")